Clinical trial inclusion criterion:
smoking at least 10 cigarettes per day

Annotated entities:
- Observation: "smoking"
- Multiplier: "at least 10 cigarettes per day"